lactation

The above is a clinical trial exclusion criterion. Annotated with entity spans:
[Condition: lactation]